有關主動脈瓣狹窄，下列敘述何者錯誤？
A. 當有心衰竭症狀時，建議接受主動脈瓣膜置換
B. 當出現心衰竭症狀時，預期餘命大約是3年
C. 鈣化性主動脈瓣狹窄，每年主動脈瓣膜面積大約下降0.1平方公分
D. 大約有兩成猝死病人是因心律不整死亡

正確答案：B. 當出現心衰竭症狀時，預期餘命大約是3年